Clinical trial inclusion criterion:
No prior prostate radiation or other definitive therapy

Entity relations:
- Has_negation("prostate radiation", "No")
- OR("prostate radiation", "definitive therapy")